Inclusion/exclusion criteria

The above is a clinical trial inclusion criterion. Annotated with entity spans:
[Non-representable: Inclusion/exclusion criteria]